Clinical trial inclusion criterion:
Age between 18-50 years old,

Entity relations:
- Has_value("Age", "between 18-50 years old")